Clinical trial exclusion criterion:
on a sodium-restricted diet

Annotated entities:
- Procedure: "sodium-restricted diet"